Clinical trial inclusion criterion:
4. Enrolled within 18 hours of commencing antimalarial treatment

Annotated entities:
- Parsing_Error: "4."
- Temporal: "within 18 hours"
- Observation: "Enrolled"
- Reference_point: "commencing antimalarial treatment"
- Procedure: "antimalarial treatment"